Clinical trial exclusion criterion:
Cardiac arrhythmias (2nd and 3rd degree heart block or premature ventricular complexes in Lown classes 4 or 5)

Entity relations:
- Has_qualifier("premature ventricular complexes", "Lown classes 4")
- Subsumes("Cardiac arrhythmia", "2nd degree heart block")
- Subsumes("Cardiac arrhythmia", "premature ventricular complexes")
- OR("Lown classes 4", "Lown classes 5")
- OR("2nd degree heart block", "3rd degree heart block")